一名受EB病毒（Epstein-Barr virus, EBV）感染的病人，其血清學檢查如下：anti-VCA IgM (+)、anti-VCA IgG (+)、anti-EA (+/-)、anti-EBNA (-)，此病人的情況屬於下列何者？[VCA：病毒殼蛋白質抗原（viral capsid antigen）；EA：早期抗原（early antigen）; EBNA：EB病毒核抗原（Epstein-Barr nuclear antigen）]
A. EB病毒感染的急性期（acute primary infection）
B. EB病毒慢性感染期（chronic primary infection）
C. 曾被EB病毒感染（past infection）
D. 曾被EB病毒感染，現在病毒再活化（reactivation）

正確答案：A. EB病毒感染的急性期（acute primary infection）